The patients present with operable unilateral invasive breast cancers without distant metastasis(stage I, II, and III)

The above is a clinical trial inclusion criterion. Annotated with entity spans:
The patients present with [Qualifier: operable] [Qualifier: unilateral] [Qualifier: invasive] [Condition: breast cancers] [Negation: without] [Condition: distant metastasis]([Measurement: stage] [Value: I, II, and III])